Active bleeding

The above is a clinical trial exclusion criterion. Annotated with entity spans:
[Condition: Active bleeding]